一位 65 歲女性病人被診斷有腦下垂體腫瘤達 2 年，突然間有嚴重頭痛、嘔吐、視力模糊等症狀，下列何種診斷為首要必須考量的病因？
A. 腦下垂體感染
B. 腦下垂體中風（apoplexy）
C. 腫瘤轉移
D. 蝶鞍空缺（empty sella）

正確答案：B. 腦下垂體中風（apoplexy）